第二常見的手部良性腫瘤是：
A. 巨細胞瘤（giant cell tumor）
B. 表皮囊腫（epidermal inclusion cyst）
C. 脂肪瘤（lipoma）
D. 腱鞘囊腫（ganglion）

正確答案：A. 巨細胞瘤（giant cell tumor）